Clinical trial exclusion criterion:
unstable medical condition like heart disease, uncontrolled hypertension, thyroid disease, diabetes, renal or liver impairment, or glaucoma

Annotated entities:
- Qualifier: "unstable"
- Condition: "medical condition"
- Condition: "heart disease"
- Condition: "hypertension"
- Qualifier: "uncontrolled"
- Condition: "thyroid disease"
- Condition: "diabetes"
- Condition: "liver impairment"
- Condition: "renal impairment"
- Condition: "glaucoma"